有關眼角膜的捐贈，下列那一項敘述並不符合醫學倫理的規範？
A. B 型肝炎、愛滋病等往生者並不適合捐贈
B. 醫生可以任由死囚的眼睛摘取角膜
C. 眼角膜組織的捐贈，屬於無償捐贈
D. 因不明原因腦部病變致死的病人，並不適合捐贈

正確答案：B. 醫生可以任由死囚的眼睛摘取角膜